Documented history of chronic HCV RNA infection with Genotype 1

The above is a clinical trial inclusion criterion. Annotated with entity spans:
Documented history of [Condition: chronic HCV] RNA infection with [Qualifier: Genotype 1]